What is the biological role of Neddylation?

Neddylation is a process that is similar to ubiquitination. Proteins in the neddylation pathway have also been linked to regulating DDR. Neddylation plays an important role in the regulation of murine and human dendritic cell function. NEDDylation is a post-translational protein modification that is tightly linked to ubiquitination and thereby protein degradation. Utilizing multiple but complementary approaches, we determined the role of an important but less understood type of PTM, namely, neddylation, in regulating DC functions. It is coupled to ubiquitination and is important for maintaining cellular homeostasis.